6. Any serious, active infection (> Grade 2) at the time of treatment.

The above is a clinical trial exclusion criterion. Annotated with entity spans:
6. Any [Qualifier: serious], [Temporal: active] [Condition: infection] ([Value: > Grade 2]) at the time of treatment.